下列何者傳遞心包膜及縱隔部壁層胸膜的知覺？
A. 迷走神經
B. 大內臟神經
C. 膈神經
D. 肋間神經

正確答案：C. 膈神經